Clinical trial exclusion criterion:
Serious cardiac dysfunction, hypertension, or hematological disorder.

Annotated entities:
- Condition: "cardiac dysfunction"
- Condition: "hypertension"
- Condition: "hematological disorder"
- Qualifier: "Serious"
- Subjective_judgement: "Serious"